Clinical trial inclusion criterion:
Women aged 20-49;

Annotated entities:
- Person: "Women"
- Person: "aged"
- Value: "20-49"